Clinical trial exclusion criterion:
Infected with HIV

Annotated entities:
- Condition: "HIV"